Clinical trial exclusion criterion:
active opportunistic infection or significant co-morbidities

Annotated entities:
- Condition: "opportunistic infection"
- Condition: "co-morbidities"
- Qualifier: "significant"
- Undefined_semantics: "significant"